known sensitivity to components of the Truvada® formulation

The above is a clinical trial exclusion criterion. Annotated with entity spans:
known [Condition: sensitivity] to components of the [Drug: Truvada]® formulation